下列何者屬於M3蕈毒鹼受體（M3 muscarinic receptor）拮抗劑，臨床上用於治療膀胱過動症（overactive bladder）？
A. pirenzepine
B. trihexyphenidyl
C. ipratropium
D. oxybutynin

正確答案：D. oxybutynin